Active atrial fibrillation

The above is a clinical trial exclusion criterion. Annotated with entity spans:
Active [Condition: atrial fibrillation]